Clinical trial inclusion criterion:
no contraindications for chemotherapy

Annotated entities:
- Procedure: "chemotherapy"
- Condition: "contraindications"
- Negation: "no"